Clinical trial exclusion criteria:
Metastatic disease (M1)/stage 4 NSCLC
Pleural or pericardial effusion greater than 100 ml in volume as documented by appropriate imaging (positron emission tomography [PET], computed tomography [CT] scan or ultrasound). If an effusion greater than 100 ml is documented by cytology to be free from malignancy and the investigator feels the patient is capable of receiving chemo/radiotherapy for their primary disease/ NSCLC, the investigator should discuss the patient with the study physician at Amgen. Effusions smaller than 100 ml would be acceptable, unless the investigator suspects that the effusion is malignant, in which case the effusions should be evaluated by cytology. Sponsor approval must be obtained before patient is randomized.
Plan to remove the tumor surgically before completing the protocol chemo/radiotherapy course
Shielding of any part of the esophagus during radiotherapy (including posterior spinal cord shielding)
Prior chemotherapy, radiotherapy, or surgery for NSCLC
Prior invasive malignancy during the past 3 years other than non-melanomatous skin cancer. Note: Patients with prior surgically-cured malignancies [eg, stage I breast cancer or prostate cancer, in-situ carcinoma of the cervix, etc] are not excluded; however, sponsor approval must be obtained before patient is randomized.
Presence or history of dysphagia or conditions predisposing to dysphagia (eg, uncontrolled gastroesophageal reflux disease [GERD], dyspepsia, etc)
History of pancreatitis
Four weeks or less since completion of treatment using an investigational product/device in another clinical study or presence of any unresolved toxicity from previous treatment
Previous treatment on this study or with a fibroblast growth factor
Known to be sero-positive for human immunodeficiency virus (HIV), hepatitis C virus (HCV), or hepatitis B virus (HBV)
Pregnant or breastfeeding women
Known sensitivity to E. coli derived products
Compromised ability of the patient to give written informed consent and/or to comply with study procedures
Refusal to sign an informed consent form to participate in this study, and sign the hospital information release form, if applicable
Unwilling or unable to complete the patient reported outcome (PRO) questionnaires
Psychological, social, familial, or geographical reasons that would prevent regular follow-up

Annotated entities:
- Condition: "Metastatic disease NSCLC"
- Condition: "(M1)/stage 4"
- Condition: "Pleural effusion"
- Condition: "pericardial effusion"
- Value: "greater than 100 ml in volume"
- Measurement: "positron emission tomography"
- Measurement: "computed tomography scan"
- Measurement: "PET"
- Measurement: "CT"
- Measurement: "ultrasound"
- Non-query-able: "Pleural or pericardial effusion greater than 100 ml in volume as documented by appropriate imaging (positron emission tomography [PET], computed tomography [CT] scan or ultrasound). If an effusion greater than 100 ml is documented by cytology to be free from malignancy and the investigator feels the patient is capable of receiving chemo/radiotherapy for their primary disease/ NSCLC, the investigator should discuss the patient with the study physician at Amgen. Effusions smaller than 100 ml would be acceptable, unless the investigator suspects that the effusion is malignant, in which case the effusions should be evaluated by cytology. Sponsor approval must be obtained before patient is randomized."
- Temporal: "before completing the protocol chemo/radiotherapy course"
- Mood: "Plan to remove the tumor surgically"
- Qualifier: "esophagus"
- Multiplier: "any part of"
- Procedure: "radiotherapy"
- Procedure: "Shielding"
- Procedure: "posterior spinal cord shielding"
- Drug: "chemotherapy"
- Procedure: "radiotherapy"
- Procedure: "surgery"
- Condition: "NSCLC"
- Temporal: "Prior"
- Condition: "malignancy"
- Qualifier: "invasive"
- Temporal: "during the past 3 years"
- Negation: "other than"
- Condition: "non-melanomatous skin cancer"
- Negation: "are not"
- Condition: "surgically-cured malignancies"
- Non-query-able: "sponsor approval must be obtained before patient is randomized"
- Temporal: "Prior"
- Condition: "dysphagia"
- Condition: "conditions predisposing to dysphagia"
- Condition: "gastroesophageal reflux disease"
- Qualifier: "uncontrolled"
- Condition: "GERD"
- Condition: "dyspepsia"
- Temporal: "history of"
- Condition: "pancreatitis"
- Temporal: "History of"
- Temporal: "Four weeks or less since completion of treatment"
- Reference_point: "completion of treatment"
- Procedure: "treatment"
- Drug: "investigational product"
- Device: "investigational device"
- Qualifier: "unresolved"
- Condition: "toxicity"
- Competing_trial: "another clinical study"
- Temporal: "previous"
- Procedure: "treatment"
- Temporal: "Previous"
- Procedure: "treatment"
- Drug: "fibroblast growth factor"
- Value: "sero-positive"
- Measurement: "human immunodeficiency virus (HIV)"
- Condition: "sero-positive for human immunodeficiency virus (HIV)"
- Condition: "sero-positive for hepatitis C virus (HCV)"
- Condition: "sero-positive for hepatitis B virus (HBV)"
- Measurement: "hepatitis C virus (HCV)"
- Measurement: "hepatitis B virus (HBV)"
- Condition: "Pregnant"
- Condition: "breastfeeding"
- Person: "women"
- Condition: "sensitivity"
- Qualifier: "E. coli derived"
- Drug: "products"
- Condition: "Compromised ability"
- Informed_consent: "give written informed consent"
- Non-representable: "comply with study procedures"
- Informed_consent: "sign an informed consent form"
- Observation: "Refusal to"
- Informed_consent: "sign the hospital information release form"
- Non-representable: "Unwilling or unable to complete the patient reported outcome (PRO) questionnaires"
- Non-query-able: "Psychological, social, familial, or geographical reasons that would prevent regular follow-up"